What is the role of STAG1/STAG2 proteins in differentiation?

STAG1/STAG2 proteins are tumour suppressor proteins that suppress cell proliferation and differentiation.